La ictericia (coloración amarillenta de piel y mucosas por aumento de los niveles de bilirrubina) puede ser de origen colestásico (obstrucción de vías) o por daño hepatocelular. Indique la respuesta correcta:
1. En la ictericia colestásica observamos: aumento persistente de alanina aminotransferasa (ALT) sin elevación de gamma glutamiltransferasa (GGT).
2. En la ictericia hepatocelular se observa un ligero aumento de la GGT (< 5 veces el límite superior de referencia) y un gran aumento de la ALT (> 10 veces el límite superior de referencia).
3. En la ictericia colestásica se observa: disminución de la bilirrubina directa y del tiempo de protrombina.
4. En la ictericia hepatocelular se observa: disminución de la fosfatasa alcalina y del tiempo de tromboplastina parcial activado.
5. En ambas ictericias podemos observar una clara disminución de la aspartato aminotransferasa (AST).

Respuesta correcta: 2. En la ictericia hepatocelular se observa un ligero aumento de la GGT (< 5 veces el límite superior de referencia) y un gran aumento de la ALT (> 10 veces el límite superior de referencia).